¿Cuál de las siguientes afirmaciones es aplicable a la apoptosis?:
1. Consiste en una muerte celular por endocitosis, que se activa mediante estímulos internos celulares.
2. Consiste en un proceso de autofagia celular en respuesta a estímulos externos.
3. Puede iniciarse por señales externas que activan los receptores de muerte celular como el factor de necrosis tumoral (TNF) o internas que afectan a la integridad de la mitocondria.
4. Consiste en la necrosis de tejidos dañados por agentes químicos.

Respuesta correcta: 3. Puede iniciarse por señales externas que activan los receptores de muerte celular como el factor de necrosis tumoral (TNF) o internas que afectan a la integridad de la mitocondria.